What are the classic signs of a basilar skull fracture?

Basilar skull fractures are fractures of the lower part of the skull. The four classic signs are:
1. Periorbital ecchymosis (“raccoon eyes”).
2. Postauricular ecchymosis (Battle sign).
3. CSF otorrhea or rhinorrhea (leakage of CSF, which is clear in appearance, from the ears or nose).
4. Hemotympanum (blood behind the eardrum).